Clinical trial inclusion criterion:
Participants must have completed 3 cycles of a bortezomib-based induction regimen (as defined by current NCCN guidelines) and have no evidence of disease progression as defined by IMWG criteria.

Annotated entities:
- Multiplier: "3 cycles"
- Drug: "bortezomib"
- Procedure: "induction regimen"
- Qualifier: "NCCN guidelines"
- Value: "no evidence of disease progression"
- Measurement: "IMWG criteria"